下列何者不是陰道癌（vaginal cancer）常見的特徵？
A. 常發生於陰道後壁
B. 常見於陰道上部
C. 常伴隨陰道疼痛
D. 陰道上皮贅瘤（vaginal intraepithelial neoplasia）有進展成侵襲陰道癌（invasive vaginal cancer）的可能性

正確答案：C. 常伴隨陰道疼痛